Which histone mark is recognized by HP1?

Histone H3 at lysine 9 trimethylation (H3K9me3)